Taking most recent DMT continuously* for no less than two years.

The above is a clinical trial inclusion criterion. Annotated with entity spans:
Taking most recent [Drug: DMT] [Multiplier: continuously]* [Temporal: for no less than two years].